Clinical trial inclusion criterion:
Patients are on no other anti-diabetic drug treatment, or on stable maximum 3000 mg daily dose metformin treatment and/or on stable dose of a DPPIV inhibitor treatment for at least the last 3 months5. HbA1c levels =6.0% (=42 mmol/mol) and =9.0% (75 mmol/mol).

Entity relations:
- Has_qualifier("anti-diabetic drug treatment", "other")
- Has_negation("anti-diabetic drug treatment", "no")
- Subsumes("=9.0%", "75 mmol/mol")
- Subsumes("=6.0%", "=42 mmol/mol")
- Has_multiplier("metformin", "maximum 3000 mg daily dose")
- Has_qualifier("maximum 3000 mg daily dose", "stable")
- Has_qualifier("DPPIV inhibitor", "stable dose")
- Has_temporal("DPPIV inhibitor", "for at least the last 3 months")
- Has_value("HbA1c levels", "=6.0%")
- Has_value("HbA1c levels", "=9.0%")
- OR("anti-diabetic drug treatment", "metformin", "DPPIV inhibitor")